Clinical trial exclusion criterion:
12. Severe hypertension with systolic >200 mmHg and diastolic >110 mmHg at rest;

Entity relations:
- Has_value("systolic", ">200 mmHg")
- Has_value("diastolic", ">110 mmHg")
- AND("Severe hypertension", "systolic")
- AND("Severe hypertension", "diastolic")